For patients of reproductive potential (males and females), use of reliable means for contraception (e.g., contraceptive pill, intrauterine device [IUD], physical barrier) throughout the trial and for 1 year following their final exposure to study treatment

The above is a clinical trial inclusion criterion. Annotated with entity spans:
For patients of [Condition: reproductive potential] (males and females), use of reliable means for [Procedure: contraception] (e.g., [Drug: contraceptive pill], [Device: intrauterine device [IUD]], [Device: physical barrier]) [Temporal: throughout the trial] and [Temporal: for 1 year following their final exposure] to study treatment